抗磷脂質抗體症候群（antiphospholipid antibody syndrome）與下列何種異常最有相關？
A. thrombocytopenia
B. proteinuria
C. photosensitivity
D. arthritis

正確答案：A. thrombocytopenia